2. Pulmonary veno-occlusive disease and/or pulmonary capillary hemangiomatosis

The above is a clinical trial exclusion criterion. Annotated with entity spans:
[Parsing_Error: 2.] [Condition: Pulmonary veno-occlusive disease] and/or [Condition: pulmonary capillary hemangiomatosis]